Describe the Disambiguate algorithm and its application in next generation sequencing data

Disambiguate is a program for computationally separating the sequencing reads of two species derived from grafted samples.